Anatomical abnormalities preventing successful peripheral catheter insertion

The above is a clinical trial exclusion criterion. Annotated with entity spans:
[Condition: Anatomical abnormalities] [Mood: preventing] [Qualifier: successful] [Device: peripheral catheter] [Procedure: insertion]